Which species is the carrier of the SFTS ( severe fever with thrombocytopenia syndrome) virus?

The possibility that SFTSV transmission may occur by both the transstadial and transovarial routes was suggested by the fact that viral RNA was detected in H. longicornis at all developmental stages. Severe fever with thrombocytopenia syndrome (SFTS) is a new emerging zoonosis.